Clinical trial exclusion criterion:
Poor glucose control (HbA1C>10 %)

Annotated entities:
- Condition: "Poor glucose control"
- Measurement: "HbA1C"
- Value: ">10 %"